青春期前，大部分的胸腺位在下列何處？
A. 上縱膈腔
B. 前縱膈腔
C. 中縱膈腔
D. 後縱膈腔

正確答案：A. 上縱膈腔